Treated with greater than 5 mg of prednisone (or equivalent) daily in the last 3 months

The above is a clinical trial exclusion criterion. Annotated with entity spans:
Treated with [Multiplier: greater than 5 mg] of [Drug: prednisone] (or equivalent) [Multiplier: daily] [Temporal: in the last 3 months]